underlying lung or heart disase

The above is a clinical trial exclusion criterion. Annotated with entity spans:
underlying [Condition: lung] or [Condition: heart disase]